Clinical trial exclusion criterion:
Known intolerance to tramadol or other contraindications for the drug

Annotated entities:
- Condition: "intolerance"
- Drug: "tramadol"
- Condition: "contraindications"
- Drug: "the drug"
- Qualifier: "other"